下列有關陰囊水腫的敘述，何者錯誤？
A. 一般男嬰發生陰囊水腫的機率約為 1~2%
B. 新生兒陰囊水腫需要跟鼠蹊部疝氣做鑑別診斷
C. 罹患陰囊水腫的男嬰，日後發生睪丸扭轉的機率較正常男嬰高
D. 陰囊水腫常需要開刀治療

正確答案：D. 陰囊水腫常需要開刀治療